Lower limb contractures impeding range of motion necessary for ambulation

The above is a clinical trial exclusion criterion. Annotated with entity spans:
[Condition: Lower limb contractures] [Mood: impeding] [Observation: range of motion necessary for ambulation]